Clinical trial exclusion criterion:
14. Previous or current radiation therapy or likelihood to receive this therapy during study participation

Entity relations:
- Has_temporal("radiation therapy", "Previous")
- OR("Previous", "current")